Clinical trial inclusion criterion:
Hemoglobin ≥ 8.0 g/dl

Annotated entities:
- Measurement: "Hemoglobin"
- Value: "≥ 8.0 g/dl"